Salivary Cortisol is a biomarker for what disease/syndrome/condition?

These results suggest that the saliva cortisol level is therefore a useful biomarker to evaluate the stress in AD patients.